Clinical trial exclusion criterion:
Patients in whom first attempt of arterial puncture is performed by 2nd year interventional cardiology fellow or by physician in charge.

Annotated entities:
- Non-query-able: "Patients in whom first attempt of arterial puncture is performed by 2nd year interventional cardiology fellow or by physician in charge"